Diabetes mellitus

The above is a clinical trial exclusion criterion. Annotated with entity spans:
[Condition: Diabetes mellitus]